No previous treatment with Clopidogrel, Prasugrel or Ticagrelor.

The above is a clinical trial inclusion criterion. Annotated with entity spans:
[Negation: No] [Temporal: previous] [Procedure: treatment] with [Drug: Clopidogrel], [Drug: Prasugrel] or [Drug: Ticagrelor].